22 歲大學生要參加大專運動會，在賽前接受評估。心臟聽診在左下胸骨邊緣有一個高頻收縮期心雜音（harsh systolic murmur）。若想要進一步分析是否有肥厚性心肌病變（hypertrophic cardiomyopathy），進行下列那一個動作，會加強聽到的收縮期雜音？
A. 坐著身體向前傾
B. Valsalva maneuver
C. squatting position
D. 左側躺

正確答案：B. Valsalva maneuver